Clinical trial exclusion criterion:
Autoimmune corneal ulcer

Annotated entities:
- Condition: "corneal ulcer"
- Qualifier: "Autoimmune"